一位 58 歲之男性不幸於上午 9 時從事水電工作時遭受到 1200 伏特之電灼傷，於上午 10 時由地區醫院轉送至醫學中心急診室，醫師診斷為臉部、右側前臂整圈、前胸及兩側大腿外側深二度至三度之電灼傷，合計占總體表面積 45%，病患體重為 65 公斤，同時累積靜脈輸液量為 0.9%生理食鹽水 500 ml ；若採用 Parkland 輸液公式（Parkland formula）來進行輸液治療，此時理論上，應該於病患受傷 24 小時內再給予多少輸液量與何種靜脈輸液？
A. 11700 ml；0.9%生理食鹽水
B. 5850 ml；5%葡萄糖水
C. 11200 ml；乳酸林格氏液
D. 5800 ml；林格氏液

正確答案：C. 11200 ml；乳酸林格氏液